Clinical trial exclusion criterion:
Live donor transplantation scheduled within 6 months

Annotated entities:
- Procedure: "Live donor transplantation"
- Temporal: "within 6 months"
- Mood: "scheduled"